Clinical trial exclusion criterion:
Uncontrolled local or systemic diseases that affects wound healing (diabetes, autoimmune or inflammatory disorders)

Annotated entities:
- Condition: "diseases local"
- Condition: "systemic diseases"
- Qualifier: "Uncontrolled"
- Qualifier: "that affects wound healing"
- Condition: "diabetes"
- Condition: "autoimmune disorders"
- Condition: "inflammatory disorders"